一位病人因喉嚨疼痛及高燒來到急診處。詢問病史，病人 2 個月前曾因為心臟問題開始規則服用醫師開的藥物；10 天前因為感冒症狀，自己到藥局買藥服用。理學檢查顯示喉嚨紅腫並有白點，體溫 39℃。血液檢查發現白血球數為 1,250/mm3，其中neutrophil 10%，monocyte 8%，lymphocyte 81%， eosinophil 1%，紅血球及血小板正常。下列何者錯誤？
A. 病人淋巴球數目增加，須進一步檢查是否有淋巴增生性疾病
B. 病人極可能有細菌感染，做過微生物培養後須即刻注射抗生素
C. 病人很可能是因為藥物而引起顆粒球減少症
D. 病人中性球的數目只有 125/mm3，抵抗力極低，最好留院觀察

正確答案：A. 病人淋巴球數目增加，須進一步檢查是否有淋巴增生性疾病